Las señales sensitivas llegan principalmente a la capa de la corteza cerebral número:
1. II.
2. III.
3. IV.
4. V.
5. VI.

Respuesta correcta: 3. IV.